Current inpatient hospitalization or active suicidal ideation requiring referral for inpatient hospitalization for safety.

The above is a clinical trial exclusion criterion. Annotated with entity spans:
[Temporal: Current] [Visit: inpatient] [Procedure: hospitalization] or [Temporal: active] [Condition: suicidal ideation] [Mood: requiring] [Procedure: referral] for [Visit: inpatient hospitalization] for safety.